Clinical trial exclusion criterion:
History of ischemic stroke or pulmonary thrombosis

Annotated entities:
- Condition: "ischemic stroke"
- Condition: "pulmonary thrombosis"
- Temporal: "History"